La ácido alcohol-resistencia se utiliza para identificar:
1. Bacterias fermentadoras.
2. Levaduras utilizadas en la producción de bebidas alcohólicas.
3. Bacterias que poseen ácidos micólicos.
4. Organismos esporulados.
5. Organismos oxidadores de sulfuros a ácido sulfúrico.

Respuesta correcta: 3. Bacterias que poseen ácidos micólicos.